Which is the genetic defect causing Neurofibromatosis type 1?

Neurofibromatosis type 1 (NF1) is due to all types of mutations in the neurofibromin (NF1) gene.